Use of steroids or drugs that interfere with the metabolism of estrogen.

The above is a clinical trial exclusion criterion. Annotated with entity spans:
Use of [Drug: steroids] or [Drug: drugs that interfere with the metabolism of estrogen].